Clinical trial exclusion criterion:
Volunteers must not have been vaccinated against HPV-Gardasil-9 (both partners)

Entity relations:
- AND("vaccinated", "HPV-Gardasil-9")
- Has_negation("vaccinated", "not")
- Has_temporal("vaccinated", "have been")